Controlled hypertension: systolic BP < 150 and diastolic BP < 90 mmHg in persons aged 60 years or older, systolic BP < 140 and diastolic BP < 90 mmHg in persons 40 through 59 years according to the JNC 8th guideline

The above is a clinical trial inclusion criterion. Annotated with entity spans:
[Qualifier: Controlled] [Condition: hypertension]: [Measurement: systolic BP] [Value: < 150] and [Measurement: diastolic BP] [Value: < 90 mmHg] in persons [Person: aged] [Value: 60 years or older], [Measurement: systolic BP] [Value: < 140] and [Measurement: diastolic BP] [Value: < 90 mmHg] in persons [Value: 40 through 59] [Person: years] according to the [Qualifier: JNC 8th guideline]